En una vuelta completa del ciclo del ácido cítrico (o ciclo de los ácidos ticarboxilicos) podemos observar que:
1. Todas las enzimas catalizan reacciones reversibles.
2. El oxígeno actúa como reactante de las reacciones catalizadas y deshidrogenasas.
3. El ATP, el acetil-CoA actúan como activadores de las enzimas alostéricas reguladoras del ciclo.
4. En cuatro reacciones de oxidación catalizadas por deshidrogenasas, se reducen 3 moléculas de NAD+ y una molécula de FAD.

Respuesta correcta: 4. En cuatro reacciones de oxidación catalizadas por deshidrogenasas, se reducen 3 moléculas de NAD+ y una molécula de FAD.